selective serotonin reuptake inhibitors

The above is a clinical trial exclusion criterion. Annotated with entity spans:
[Drug: selective serotonin reuptake inhibitors]